Clinical trial exclusion criterion:
allergic history to dexmedetomidine

Entity relations:
- Has_temporal("allergic", "history")
- AND("allergic", "dexmedetomidine")